En la práctica farmacéutica se utiliza alcohol oficinal que reúne las condiciones para uso farmacéutico y se califica así al alcohol:
1. De 95º o alcohol de 96º que posee a la salida de fábrica.
2. De 95º o alcohol de 95º que posee a la salida de fábrica.
3. De mayor poder desinfectante y bactericida.
4. De 100º.
5. De mayor poder desinfectante aunque no bactericida.

Respuesta correcta: 1. De 95º o alcohol de 96º que posee a la salida de fábrica.